Hemoglobin = 11 g/dL for female subjects; = 12 g/dL for male subjects.

The above is a clinical trial inclusion criterion. Annotated with entity spans:
[Measurement: Hemoglobin] [Value: = 11 g/dL] for [Person: female] subjects; [Value: = 12 g/dL] for [Person: male] subjects.